Clinical trial inclusion criterion:
Patients may have received chemotherapy for hormone-sensitive metastatic prostate cancer only, but it must not have lasted for more than 6 months. At least 12 months must have elapsed since completion of chemotherapy.

Annotated entities:
- Procedure: "chemotherapy"
- Qualifier: "hormone-sensitive"
- Qualifier: "metastatic"
- Condition: "prostate cancer"
- Multiplier: "lasted for more than 6 months"
- Negation: "not"
- Temporal: "At least 12 months must have elapsed since completion of chemotherapy"
- Reference_point: "completion of chemotherapy"
- Procedure: "chemotherapy"